La reacción de Diels Alder es un ejemplo de reacción:
1. Concertada y estereoespecífica.
2. Sustitución nucleófila de orden 2.
3. Sustitución nucleófila de orden 1.
4. Polimerización por condensación.
5. Adición nucleófila.

Respuesta correcta: 1. Concertada y estereoespecífica.